反股寡核甘酸（antisense oligonucleotide）藥物mipomersen其主要用於治療同型性家族性高膽固醇血症 （homozygous familial hypercholesterolemia），藉由降低血中low density lipoprotein (LDL)含量以達降血脂療效，下列何者為其主要之抑制標的？
A. PCSK9
B. apoC-III
C. apoB-100
D. apoA-I

正確答案：C. apoB-100